Clinical trial inclusion criterion:
Expanded Disability Status Scale (EDSS) score less than equals to (<=) 5.0.

Entity relations:
- Has_value("Expanded Disability Status Scale (EDSS) score", "less than equals to (<=) 5.0")